Clinical trial inclusion criterion:
Platelet count of 100,000/mm3 or greater

Annotated entities:
- Measurement: "Platelet count"
- Value: "100,000/mm3 or greater"